Clinical trial inclusion criterion:
Reassuring fetal health assessment (no abnormal findings in fetal assessment, see below)

Entity relations:
- Has_value("fetal health assessment", "Reassuring")
- Has_negation("abnormal findings", "no")
- AND("fetal assessment", "abnormal findings")
- Subsumes("fetal health assessment", "fetal assessment")